Clinical trial exclusion criterion:
Immunosuppressive disorders or medications (including oral prednisone >10 mg daily, recent chemotherapy treatment)

Entity relations:
- Has_multiplier("oral prednisone", ">10 mg daily")
- Subsumes("Immunosuppressive medications", "oral prednisone")
- OR("Immunosuppressive disorders", "Immunosuppressive medications")
- OR("oral prednisone", "chemotherapy")